關於荷爾蒙療法的敘述，下列何者錯誤？
A. 使用荷爾蒙可預防骨質疏鬆，建議長期使用
B. 建議用最低有效劑量以避免副作用
C. 有不確定診斷的陰道出血，使用荷爾蒙前應先做檢查
D. 有膽囊疾病患者不建議使用荷爾蒙

正確答案：A. 使用荷爾蒙可預防骨質疏鬆，建議長期使用